Clinical trial exclusion criterion:
2. Myocardial infarction or unstable angina within 6 months prior to Day 1 of the study.

Entity relations:
- Has_index("within 6 months prior to Day 1 of the study", "Day 1 of the study")
- Has_temporal("Myocardial infarction", "within 6 months prior to Day 1 of the study")
- OR("Myocardial infarction", "unstable angina")